下列關於睡眠呼吸中止症候群（sleep apnea syndrome）的敘述，何者錯誤？
A. 阻塞型睡眠呼吸中止症候群（obstructive sleep apnea），常有夜間打鼾、白天頭痛的病史
B. 阻塞型睡眠呼吸中止症候群的診斷是依據睡眠多項生理（polysomnography）檢查中發現，鼻息氣流與肺、腹部的呼吸動作同時中止
C. 阻塞型睡眠呼吸中止症候群較容易發生在肥胖及下顎短的人身上
D. 睡眠呼吸中止症候群會增加心血管疾病

正確答案：B. 阻塞型睡眠呼吸中止症候群的診斷是依據睡眠多項生理（polysomnography）檢查中發現，鼻息氣流與肺、腹部的呼吸動作同時中止